Clinical trial exclusion criterion:
12. Radiation therapy within 4 weeks prior to, or concurrent with study

Annotated entities:
- Procedure: "Radiation therapy"
- Temporal: "within 4 weeks prior to study"
- Temporal: "concurrent with study"
- Reference_point: "study"